脊椎側彎在胸椎第六節以上，需使用下列何種背架矯正？
A. 波士頓背架（Boston brace）
B. 米華基背架（Milwaukee brace）
C. 泰勒背架（Taylor brace）
D. 奈特背架（Knight brace）

正確答案：B. 米華基背架（Milwaukee brace）